Clinical trial exclusion criterion:
Woman who are breastfeeding, pregnant or planning to become pregnant during the course of the study

Entity relations:
- Has_mood("pregnant", "planning to become")
- Has_temporal("breastfeeding", "during the course of the study")
- OR("breastfeeding", "pregnant", "pregnant")